Women with recently diagnosed breast cancer and who will receive NAC to reduce tumor burden before surgery. (including locally advanced breast cancer (LABC) according to clinical assessment; or tumor size > 2cm, that is, at least T2 in TNM staging).

The above is a clinical trial inclusion criterion. Annotated with entity spans:
[Person: Women] with recently diagnosed [Condition: breast cancer] and who will receive [Procedure: NAC] to [Qualifier: reduce tumor burden] [Temporal: before surgery]. (including locally advanced breast cancer (LABC) according to clinical assessment; or tumor size > 2cm, that is, at least T2 in TNM staging).